Clinical trial inclusion criteria:
Patients with craniotomy for supratentorial tumors under general anesthesia
American Society of Anaesthesiologists (ASA) 2 and stable ASA 3 patients
Elective surgery
Patients with Glasgow Coma Scale (GCS) 15/15

Annotated entities:
- Procedure: "craniotomy"
- Condition: "supratentorial tumors"
- Procedure: "general anesthesia"
- Measurement: "American Society of Anaesthesiologists"
- Measurement: "ASA"
- Value: "2"
- Measurement: "ASA"
- Value: "3"
- Qualifier: "stable"
- Procedure: "Elective surgery"
- Measurement: "Glasgow Coma Scale"
- Measurement: "GCS"
- Value: "15/15"